Clinical trial inclusion criteria:
anyone not excluded and consenting

Annotated entities:
- Post-eligibility: "anyone not excluded and consenting"